Las proteínas nuevas destinadas a la secreción se sintetizan en:
1. Aparado de Golgi.
2. Retículo endoplásmico liso.
3. Polisomas libres.
4. Núcleo.
5. Retículo endoplásmico rugoso.

Respuesta correcta: 5. Retículo endoplásmico rugoso.